Aged 18-80 years.

The above is a clinical trial inclusion criterion. Annotated with entity spans:
[Person: Aged] [Value: 18-80 years].